¿En cuál de los siguientes fármacos, la monitorización terapéutica se realiza mediante la evaluación farmacodinámica y no como es habitual con la determinación de su concentración en suero?:
1. Ácido Valproico.
2. Tobramicina.
3. Ciclosporina A.
4. Warfarina y Acenocumarol.

Respuesta correcta: 4. Warfarina y Acenocumarol.